Clinical trial inclusion criterion:
Unresectable, histologically confirmed hepatocellular carcinoma with evident disease limited to liver.

Entity relations:
- Has_value("histologically", "confirmed")
- AND("hepatocellular carcinoma", "histologically")
- Has_qualifier("hepatocellular carcinoma", "Unresectable")
- Has_qualifier("hepatocellular carcinoma", "disease limited to liver")